Clinical trial inclusion criterion:
Fitzpatrick Skin phototype IV-VI, non-white race/ethnicity, including but not limited to - --African Americans, Asians, Pacific Islanders and Hispanics.

Entity relations:
- Has_value("Fitzpatrick Skin phototype", "IV-VI")
- Subsumes("non-white race/ethnicity", "African Americans")
- OR("African Americans", "Hispanics", "Asians", "Pacific Islanders")